Clinical trial exclusion criterion:
Patients with neuromuscular or neurosensory deficiency, which would limit the ability to assess pain levels

Entity relations:
- OR("neuromuscular deficiency", "neurosensory deficiency")